Clinical trial exclusion criterion:
Gastrointestinal or genitourinary bleeding within the prior 3 months, or major surgery within 2 months.

Entity relations:
- Has_temporal("Gastrointestinal bleeding", "within the prior 3 months")
- Has_temporal("major surgery", "within 2 months")
- OR("Gastrointestinal bleeding", "genitourinary bleeding")
- OR("Gastrointestinal bleeding", "major surgery")